Clinical trial exclusion criterion:
Evidence of sympathetic integrity below the lesion level by the skin axon-reflex vasodilatation (SkARV) test;

Annotated entities:
- Observation: "sympathetic integrity"
- Qualifier: "below the lesion level"
- Measurement: "test skin axon-reflex vasodilatation"
- Measurement: "SkARV"